¿Cuál de las siguientes enzimas cataliza una reacción hidrolítica?:
1. Lactato deshidrogenasa.
2. Quimotripsina.
3. Fumarasa.
4. Triosa fosfato isomerasa.
5. ARN polimerasa.

Respuesta correcta: 2. Quimotripsina.